Clinical trial inclusion criterion:
Male or female

Annotated entities:
- Person: "Male"
- Person: "female"